有關naloxone藥理作用之敘述，下列何者正確？
A. 口服有效
B. 具有提高疼痛閾值（threshold）的作用
C. 可以拮抗morphine所引起的呼吸抑制作用
D. 可以拮抗barbiturates藥物所引起的呼吸抑制作用

正確答案：C. 可以拮抗morphine所引起的呼吸抑制作用